2. Screening tool: History. Government-issued forms of identification (e.g. driver s license, birth certificate) will be required when participant appears to be out of age range.

The above is a clinical trial inclusion criterion. Annotated with entity spans:
[Parsing_Error: 2.] Screening tool: [Temporal: History]. [Not_a_criteria: Government-issued forms of identification (e.g. driver s license, birth certificate) will be required when participant appears to be out of age range.]